Which proteins does p110α interact with?

p110α interacts with p85α and RAS proteins.